Participants considered in stable health in the opinion of the investigator

The above is a clinical trial inclusion criterion. Annotated with entity spans:
Participants considered in [Observation: stable health] [Non-query-able: in the opinion of the investigator]